Clinical trial inclusion criterion:
HAMA score=17

Entity relations:
- Has_value("HAMA score", "=17")